Which effects create neighborhoods of transcriptional regulation in eukaryotes?

Enhancer Sharing Promotes Neighborhoods of Transcriptional Regulation Across Eukaryotes